Person is unwilling/unable to follow instructions.

The above is a clinical trial exclusion criterion. Annotated with entity spans:
[Post-eligibility: Person is unwilling/unable to follow instruction]s.